Clinical trial exclusion criterion:
Serious, uncontrolled, non-malignant illness

Annotated entities:
- Condition: "non-malignant illness"
- Qualifier: "uncontrolled"
- Qualifier: "Serious"